Regular cycles

The above is a clinical trial inclusion criterion. Annotated with entity spans:
[Condition: Regular cycles]